(iii) for subjects enrolled at Indian sites: oral poliomyelitis vaccine (OPV) received during National Immunization Days (NIDs) and supplementary immunization activity days (SIADs)

The above is a clinical trial exclusion criterion. Annotated with entity spans:
(iii) for subjects enrolled at [Visit: Indian sites]: [Drug: oral poliomyelitis vaccine (OPV)] received [Temporal: during National Immunization Days (NIDs)] and [Reference_point: supplementary immunization activity days (SIADs)]